Clinical trial exclusion criteria:
Nonfluency or inability to communicate in English spoken language
Inability to participate or attend biweekly 30 minute session over 14 weeks
Frank psychosis
Active self harm urges
Serious medical illness
Active substance or alcohol use or dependence that could interfere with participation
Diagnoses of mental retardation, dementia or delirium
Pregnant women

Annotated entities:
- Non-query-able: "Nonfluency or inability to communicate in English spoken language"
- Non-query-able: "Inability to participate or attend biweekly 30 minute session over 14 weeks"
- Condition: "psychosis"
- Qualifier: "Frank"
- Condition: "self harm urges"
- Temporal: "Active"
- Condition: "medical illness"
- Qualifier: "Serious"
- Undefined_semantics: "medical illness"
- Subjective_judgement: "Serious"
- Undefined_semantics: "Serious"
- Condition: "substance use or dependence"
- Condition: "alcohol use or dependence"
- Subjective_judgement: "that could interfere with participation"
- Non-query-able: "that could interfere with participation"
- Condition: "mental retardation"
- Condition: "dementia"
- Condition: "delirium"
- Condition: "Pregnant"
- Person: "women"